1. Patient age ≥ 12 years

The above is a clinical trial inclusion criterion. Annotated with entity spans:
[Parsing_Error: 1.] Patient [Person: age] [Value: ≥ 12 years]